Clinical trial exclusion criterion:
Subject has scoliosis of greater than ten (10) degrees (both angular and rotational).

Annotated entities:
- Condition: "scoliosis"
- Qualifier: "greater than ten (10) degrees"
- Qualifier: "angular"
- Qualifier: "rotational"